Clinical trial inclusion criterion:
F; age 18 to 70

Entity relations:
- Has_value("age", "18 to 70")